Metastatic breast cancer (BR)

The above is a clinical trial inclusion criterion. Annotated with entity spans:
[Condition: Metastatic breast cancer] (BR)